IVF/ICSI fertilisation

The above is a clinical trial inclusion criterion. Annotated with entity spans:
[Procedure: IVF]/[Procedure: ICSI fertilisation]